Clinical trial exclusion criterion:
Uncontrolled hypertension, defined as sustained blood pressure = 180/110 mm Hg (systolic BP = 180 mm Hg and/or diastolic BP = 110 mm Hg) prior to randomisation

Annotated entities:
- Condition: "hypertension"
- Qualifier: "Uncontrolled"
- Measurement: "blood pressure"
- Value: "= 180/110 mm Hg"
- Measurement: "systolic BP"
- Value: "= 180 mm Hg"
- Measurement: "diastolic BP"
- Value: "= 110 mm Hg"